Clinical trial exclusion criterion:
Patient has received a liver transplant from a non-heart beating donor

Entity relations:
- Has_negation("heart beating", "non")
- Has_qualifier("donor", "heart beating")